11 歲的林小弟是學校田徑校隊裡的運動健將。最近他發現左膝前下側的小腿上端，髕骨下緣下方約 4 公分處紅腫了起來，看起來像是隆起的小丘；按壓時硬硬的，很痛。運動時在跑步或跳躍當中特別痛，不過休息一下就好了。但是這幾天變成休息時也會痛，特別是由蹲、坐姿要站起來時尤然。林小弟最有可能發生了：
A. 跳躍者膝（jumper's knee）
B. Osgood-Schlatter 氏症
C. 貝克氏囊腫（Baker's cyst）
D. 髕前黏液囊炎（prepatellar bursitis）

正確答案：B. Osgood-Schlatter 氏症